What is Synucleinopathy?

Synucleinopathy is an autosomal-dominant disease characterised by misfolding of presynaptic synuclein and the formation of Lewy bodies with ubiquitin-ligase activity.